Serum potassium >5.4 mmol/L.

The above is a clinical trial exclusion criterion. Annotated with entity spans:
[Measurement: Serum potassium] [Value: >5.4 mmol/L].